復健醫學上使用短波（shortwave）治療有許多需注意事項，但下列何者不是其禁忌症？
A. 心臟節律器使用者
B. 人工膝關節患處
C. 背部治療處骨質疏鬆症
D. 血友病關節慢性病變

正確答案：D. 血友病關節慢性病變